Clinical trial exclusion criterion:
History of erythropoietin, i. v. or oral iron therapy, and blood transfusion in previous 12 weeks and/or such therapy planned within the next 6 months.

Entity relations:
- Has_mood("within the next 6 months", "planned")
- Has_temporal("erythropoietin", "in previous 12 weeks")
- Has_index("within the next 6 months", "the next 6 months")
- OR("erythropoietin", "oral iron therapy", "blood transfusion", "i. v. iron therapy")
- OR("in previous 12 weeks", "within the next 6 months")